Clinical trial inclusion criterion:
Hypersensitivity or allergy to one of the study drugs

Entity relations:
- AND("Hypersensitivity", "study drugs")
- OR("Hypersensitivity", "allergy")